Received BCR and/or BCL2 inhibitors were intolerant or had relapsed/refractory disease afterwards.

The above is a clinical trial inclusion criterion. Annotated with entity spans:
Received [Drug: BCR] and/or [Drug: BCL2 inhibitors] were [Condition: intolerant] or had [Condition: relapsed]/[Condition: refractory disease] [Temporal: afterwards].